Clinical trial exclusion criterion:
Patient greater than age 16 years

Entity relations:
- Has_value("age", "greater than 16 years")